Intent to withdraw advanced life support as per the ICU physician;

The above is a clinical trial exclusion criterion. Annotated with entity spans:
[Non-query-able: Intent to withdraw advanced life support as per the ICU physician];